下列何種疾病無法用異體造血幹細胞移植（hematopoietic stem cell transplantation）的方式來達到長期緩解？
A. 黏多醣症
B. 嚴重再生不良性貧血
C. 重度海洋性貧血
D. 肝細胞癌

正確答案：D. 肝細胞癌